一位 80 歲男性病人因意識模糊被家人送來急診，家人注意到病人近 2 星期來倦怠、食慾不振、體重減輕，身體檢查並無特別發現，抽血檢查BUN 30 mg/dL、Cr 1.2 mg/dL、Na+ 138 mM（mmol/L）、 mM、K+ 3.5 mM、Ca2+ 2.9 mM。下列何者為最優先之處置？
A. 給予食鹽水加利尿劑
B. 給予靜脈注射 bisphosphonate
C. 做腦部磁振影像檢查
D. 做脊椎穿刺檢查

正確答案：A. 給予食鹽水加利尿劑